Clinical trial exclusion criterion:
Significant alcohol withdrawal (CIWA>8) at screening, after confirming a blood alcohol level of zero.

Annotated entities:
- Qualifier: "Significant"
- Condition: "alcohol withdrawal"
- Measurement: "CIWA"
- Value: ">8"
- Temporal: "at screening"
- Measurement: "blood alcohol level"
- Value: "zero"